Clinical trial inclusion criterion:
MRI showing no skip lesion

Annotated entities:
- Procedure: "MRI"
- Negation: "no"
- Observation: "skip lesion"